Clinical trial exclusion criterion:
history of poorly controlled hypertension

Entity relations:
- AND("history", "poorly controlled hypertension")